Clinical trial inclusion criterion:
4. Outpatients

Annotated entities:
- Parsing_Error: "4."
- Visit: "Outpatients"